Clinical trial exclusion criterion:
Hepatitis B surface antigen positive

Annotated entities:
- Measurement: "Hepatitis B surface antigen"
- Value: "positive"